Subjects with a history of thrombosis or other reason (other than sickle cell disease) for enhanced thrombotic risk

The above is a clinical trial exclusion criterion. Annotated with entity spans:
Subjects with a [Temporal: history] of [Condition: thrombosis] or other reason ([Negation: other than] [Condition: sickle cell disease]) for [Mood: enhanced] [Condition: thrombotic risk]